Simpson grading is used to describe resection of which brain tumor?

The Simpson grading system was used to assess the extent of surgical resection of meningioma.